History of cataracts or glaucoma or ocular hypertension

The above is a clinical trial exclusion criterion. Annotated with entity spans:
History of [Condition: cataracts] or [Condition: glaucoma] or [Condition: ocular hypertension]